使用 tacrolimus 或 pimecrolimus 藥膏治療異位性皮膚炎，與使用類固醇藥膏比較，其最大的優點在於：
A. 止癢效果較快
B. 不會引起毛囊炎
C. 不會引起皮膚萎縮
D. 價錢較便宜

正確答案：C. 不會引起皮膚萎縮